In which cells does TLR7 escape X-chromosome inactivation?

immune cells